下列何者不是身體達成免疫系統自體耐受性（self-tolerance）的機轉？
A. 周邊不反應（peripheral anergy）
B. 株落刪除（clonal deletion）
C. 株落增殖（clonal proliferation）
D. 中樞耐受性（central tolerance）

正確答案：C. 株落增殖（clonal proliferation）